History of falls or dizziness at exit from bed in the morning (at least two incidents in the past year)

The above is a clinical trial inclusion criterion. Annotated with entity spans:
History of [Condition: falls] or [Condition: dizziness] [Temporal: at exit from bed in the morning] ([Multiplier: at least two] [Condition: incidents] [Temporal: in the past year])